下列關於pancreatic pseudocysts的治療，何者錯誤？
A. 治療目的在緩和症狀及預防併發症
B. 必須和胰臟囊狀腫瘤（cystic neoplasm）做鑑別診斷
C. 假如檢查結果顯示有下游的胰管阻塞，應優先考慮做外引流（external drainage）手術
D. 若沒有任何症狀，也沒有增大的情況下，可考慮先觀察

正確答案：C. 假如檢查結果顯示有下游的胰管阻塞，應優先考慮做外引流（external drainage）手術